Clinical trial exclusion criterion:
Treated with rituximab in the last 12 months

Entity relations:
- Has_temporal("rituximab", "in the last 12 months")